List all approved indications for Glivec

Dermatofibrosarcoma protuberans (DFSP) is an uncommon cutaneous neoplasm.